Clinical trial inclusion criterion:
All subjects will speak English as their first language or demonstrate proficiency in English (defined as reaching a scaled score of > 11 on the WAIS vocabulary test).

Entity relations:
- Has_qualifier("speak English", "first language")
- Has_value("WAIS vocabulary test", "> 11")
- Subsumes("proficiency in English", "WAIS vocabulary test")
- OR("speak English", "proficiency in English")